李先生是一位 40 歲的模板工人，因口腔癌接受了由耳鼻喉科團隊所進行的廣泛性切除與頸部淋巴腺廓清手術，所造成的組織缺損立即由整形外科團隊以大小約 10 乘 6 公分的橈動脈前臂游離皮瓣進行顯微重建手術，前後耗時約十小時。身為住院醫師，有關手術後照顧李先生應注意的事項，何者最不適當？
A. 每小時觀察皮瓣血流狀態如顏色、溫度、微血管再充填（capillary refilling）
B. 每小時進行都卜勒（Doppler）血流計檢查
C. 頸部傷口放置砂袋壓迫血管吻合處以避免出血
D. 監測尿輸出量

正確答案：C. 頸部傷口放置砂袋壓迫血管吻合處以避免出血